Clinical trial exclusion criterion:
significant unstable or uncontrolled medical/psychiatric disease

Entity relations:
- Has_qualifier("medical disease", "unstable")
- Has_qualifier("medical disease", "significant")
- OR("unstable", "uncontrolled")
- OR("medical disease", "psychiatric disease")